Clinical trial inclusion criterion:
Glomerular filtration rate (GFR) ≥ 40 ml/min (estimated using Modification of Diet in Renal Disease (MDRD) formula) in the last 4 months.

Annotated entities:
- Measurement: "Glomerular filtration rate (GFR)"
- Value: "≥ 40 ml/min"
- Qualifier: "Modification of Diet in Renal Disease (MDRD) formula"
- Temporal: "in the last 4 months"